age <18y

The above is a clinical trial exclusion criterion. Annotated with entity spans:
[Person: age] [Value: <18y]